Clinical trial exclusion criterion:
Mild Cognitive Impairment (MCI);

Annotated entities:
- Condition: "Mild Cognitive Impairment"
- Condition: "MCI"